Subject with active peptic ulceration

The above is a clinical trial exclusion criterion. Annotated with entity spans:
Subject with [Qualifier: active] [Condition: peptic ulceration]